對於肝衰竭病患的蛋白質給予，何種胺基酸較可以避免肝腦病變？
A. 精胺酸（Arginine）
B. 麩醯胺（Glutamine）
C. 支鏈性胺基酸（Branched chain amino acids）
D. 任何胺基酸均可

正確答案：C. 支鏈性胺基酸（Branched chain amino acids）